2. Recent (< 3 months) acute macrovascular event e.g. acute coronary syndrome or cardiac surgery.

The above is a clinical trial exclusion criterion. Annotated with entity spans:
[Parsing_Error: 2.] [Temporal: Recent] ([Temporal: < 3 months]) [Condition: acute macrovascular event] e.g. [Condition: acute coronary syndrome] or [Condition: cardiac surgery].